8. Known or suspected intolerance or hypersensitivity to the investigational product(s), closely-related compounds, or any of the stated ingredients.

The above is a clinical trial exclusion criterion. Annotated with entity spans:
8. [Undefined_semantics: Known or suspected intolerance or hypersensitivity to the investigational product(s), closely-related compounds, or any of the stated ingredients.]